List the three most prevalent pathogenic species of Borrelia in Europe.

The most prevalent pathogenic species of Borrelia in Europe are: B. afzelii, B. garinii and B. burgdorferi ss.